關於甲狀腺舌骨囊腫（thyroglossal duct cyst），下列敘述何者錯誤？
A. 多位於前頸部上方中央部分
B. 可隨	吞嚥動作而上下移動
C. 切除該囊腫，需把舌骨中段部分一併切去
D. 常發現於新生兒

正確答案：D. 常發現於新生兒